Clinical trial inclusion criterion:
Age 60 years or older.

Entity relations:
- Has_value("Age", "60 years or older")